下列何種神經肌肉阻斷劑的作用 duration 最短，因其容易被 pseudocholinesterase 分解？
A. Alcuronium
B. Doxacurium
C. Pancuronium
D. Succinylcholine

正確答案：D. Succinylcholine